Clinical trial exclusion criterion:
Patients who have received the last administration of an anticancer therapy including chemotherapy, immunotherapy, hormonal therapy and monoclonal antibodies </= 2 weeks prior to starting the study drug, or who have not recovered from the side effects of such therapy

Entity relations:
- Has_index("</= 2 weeks prior to starting the study drug", "starting the study drug")
- Subsumes("anticancer therapy", "chemotherapy")
- Has_temporal("anticancer therapy", "</= 2 weeks prior to starting the study drug")
- OR("chemotherapy", "immunotherapy", "hormonal therapy", "monoclonal antibodies")
- OR("anticancer therapy", "recovered from the side effects of such therapy")